upper respiratory tract infection

The above is a clinical trial exclusion criterion. Annotated with entity spans:
[Condition: upper respiratory tract infection]